下列有關迷走神經（vagus nerve）之敘述，何者錯誤？
A. 喉外神經（external laryngeal nerve）控制肌肉造成聲襞（vocal folds）緊繃
B. 其分枝形成頸襻（ansa cervicalis）之下根（inferior root）
C. 其分枝喉返神經（recurrent laryngeal nerve）控制喉內肌肉
D. 迷走神經於鎖骨下動脈（subclavian artery）前方跨越

正確答案：B. 其分枝形成頸襻（ansa cervicalis）之下根（inferior root）